Clinical trial exclusion criterion:
Patients requiring long-acting opioid pain management (including fentanyl patch, oxycontin, etc) for over 3 weeks immediately prior to surgery

Entity relations:
- Has_mood("long-acting opioid", "requiring")
- Subsumes("long-acting opioid", "fentanyl patch")
- Has_multiplier("long-acting opioid", "for over 3 weeks")
- Has_temporal("long-acting opioid", "immediately prior to surgery")
- OR("fentanyl patch", "oxycontin")